6. Has a negative pregnancy test at the Screening visit. An exception for the pregnancy test requirement will be granted for subjects reporting surgical sterilization in medical history

The above is a clinical trial inclusion criterion. Annotated with entity spans:
[Parsing_Error: 6.] Has a [Value: negative] [Measurement: pregnancy test] [Temporal: at the Screening visit]. [Parsing_Error: An exception for the pregnancy test requirement will be granted for subjects reporting surgical sterilization in medical history]